Clinical trial exclusion criterion:
DSM-IV diagnosis of Alcohol or Substance Abuse within the last one month (except nicotine) or DSM-5 diagnosis of Substance Use Disorder in the last six months (except nicotine)

Entity relations:
- Has_qualifier("Alcohol Abuse", "DSM-IV")
- Has_negation("nicotine", "except")
- Has_temporal("Alcohol Abuse", "within the last one month")
- AND("Alcohol Abuse", "nicotine")
- Has_temporal("Substance Use Disorder", "in the last six months")
- Has_qualifier("Substance Use Disorder", "DSM-5")
- Has_negation("nicotine", "except")
- AND("Substance Use Disorder", "nicotine")
- OR("Alcohol Abuse", "Substance Abuse")
- OR("Alcohol Abuse", "Substance Use Disorder")